下列有關面神經（facial nerve）負責傳遞舌前三分之二的味覺之分支的敘述，何者正確？
A. 穿過莖乳突孔（stylomastoid foramen）
B. 穿過鼓室，是為鼓室神經（tympanic nerve）
C. 穿過翼管（pterygoid canal）
D. 其細胞本體位於膝狀神經節（geniculate ganglion）

正確答案：D. 其細胞本體位於膝狀神經節（geniculate ganglion）